Sympathetic preganglionic neurons 位於何處？
A. Thoracic spinal cord 與 lumbar spinal cord
B. Brain stem 及 sacral spinal cord
C. Paravertebral sympathetic ganglia
D. Prevertebral ganglia

正確答案：A. Thoracic spinal cord 與 lumbar spinal cord